Clinical trial exclusion criterion:
American Heart Association class >3

Entity relations:
- Has_value("American Heart Association class", ">3")